Clinical trial inclusion criteria:
- Patient with IVF cycle and therefore having frozen-thawed embryos
Regular menstruation cycle
Patient's willingness to participate in the study

Annotated entities:
- Procedure: "IVF cycle"
- Device: "frozen-thawed embryos"
- Condition: "Regular menstruation cycle"
- Informed_consent: "Patient's willingness to participate in the study"